Las proteínas ribosómicas se unen a los ARNr en el:
1. Complejo de poro nuclear.
2. Citoplasma.
3. Nucleoplasma.
4. Nucleolo.
5. Citosol.

Respuesta correcta: 4. Nucleolo.